9. Subjects with clinical symptoms or signs of gastrointestinal obstruction and/or who require drainage gastrostomy tube and/or parenteral hydration or nutrition.

The above is a clinical trial exclusion criterion. Annotated with entity spans:
[Parsing_Error: 9.] Subjects with [Condition: clinical symptoms] or [Condition: signs of gastrointestinal obstruction] and/or who require [Device: drainage gastrostomy tube] and/or [Procedure: parenteral hydration] or nutrition.